Clinical trial exclusion criterion:
Life expectancy <12 months

Entity relations:
- Has_value("Life expectancy", "<12 months")